Clinical trial exclusion criterion:
13. Concomitant treatment with other experimental compounds

Annotated entities:
- Parsing_Error: "13."
- Temporal: "Concomitant"
- Drug: "experimental compounds"